A la cantidad de ADN en un genoma se le denomina valor:
1. A.
2. D.
3. An.
4. C.
5. Cn.

Respuesta correcta: 4. C.